DNA 複製時常有鹼基錯誤配對發生在新合成股上，細胞中有錯誤配對修復（mismatch repair）的機制，可除去含有錯誤配對的新合成股（newly synthesized DNA strand），下列何者為此作用的主要酵素？
A. DNA 聚合酶（polymerase β, γ）, DNA 接合酶（ligase）校對系統
B. Rec A, Rec F, Rec O, Rec R, SSB 複製系統
C. Umu C, Umu D 強制複製（error-prone replication）系統
D. Mut H, L, S 複合物辨認系統

正確答案：D. Mut H, L, S 複合物辨認系統